Clinical trial inclusion criterion:
Patient with Social Security

Annotated entities:
- Non-query-able: "Patient with Social Security"